Clinical trial inclusion criterion:
Patients with HBsAg negative, but HBcAb positive (regardless of HBsAb status) should have a HBV DNA testing performed and protocol eligibility determined as follow:

Annotated entities:
- Measurement: "HBsAg"
- Value: "negative"
- Measurement: "HBcAb"
- Value: "positive"
- Procedure: "HBV DNA testing"
- Parsing_Error: "Patients with HBsAg negative, but HBcAb positive (regardless of HBsAb status) should have a HBV DNA testing performed and protocol eligibility determined as follow"